Clinical trial exclusion criterion:
Presence of sliding hiatus hernia as defined by flap valve grade IV disruption of morphology at gastro-esophageal junction

Annotated entities:
- Condition: "hiatus hernia"
- Qualifier: "sliding"
- Measurement: "flap valve disruption of morphology"
- Value: "grade IV"
- Qualifier: "at gastro-esophageal junction"